下列何者會引起枕骨部位的頭痛？
A. 急性上頜竇炎
B. 急性額竇炎
C. 急性前群篩竇炎
D. 急性後群篩竇炎

正確答案：D. 急性後群篩竇炎